Prior history of citalopram treatment failure at appropriate doses and duration

The above is a clinical trial exclusion criterion. Annotated with entity spans:
[Context_Error: Prior history of citalopram treatment failure at appropriate doses and duration]